Which disorders are caused by de novo mutations in ZSWIM6?

Mutations in the ZSWIM6 gene, which encodes the cellular iron exporter ZEB6, are the cause of de novo autosomal recessive acromelic frontonasal dysostosis and Leber's hereditary optic neuropathy and/or dystonia.